Clinical trial exclusion criterion:
Uncontrolled concurrent disease

Annotated entities:
- Condition: "concurrent disease"
- Qualifier: "Uncontrolled"